Clinical trial inclusion criterion:
Patients must be >= 19 years of age

Entity relations:
- Has_value("age", ">= 19 years")